35 歲男性在甲狀腺出現一個腫瘤。病理檢查發現腫瘤中有類澱粉（amyloid）沉積。下列關於這類腫瘤的敘述，何者最適當？
A. 甲狀腺內均有 C-cell hyperplasia
B. 腫瘤細胞不含 thyroglobulin
C. 最初症狀一定有 hypocalcemia
D. RET 突變與腫瘤的侵犯潛力無關

正確答案：B. 腫瘤細胞不含 thyroglobulin